Clinical trial exclusion criterion:
Patient has New York Heart Association (NYHA) class III/IV heart failure.

Annotated entities:
- Measurement: "New York Heart Association"
- Measurement: "NYHA"
- Value: "class III/IV"
- Condition: "heart failure"